Clinical trial inclusion criterion:
Newly-diagnosed or recurrent (local, regional, metastatic) malignant melanoma or breast cancer patients in whom SLN mapping is indicated

Entity relations:
- Has_temporal("malignant melanoma", "Newly-diagnosed")
- Has_qualifier("malignant melanoma", "local")
- OR("malignant melanoma", "breast cancer")
- OR("local", "regional", "metastatic")
- OR("Newly-diagnosed", "recurrent")